心臟手術中，心肌常承受缺血-再灌流（ischemia-reperfusion）的傷害，導致心肌處於能量供應失常的狀況，則下列何者正確？① 臨床上常呈現低心輸出症候群（LCOS:low cardiac output syndrome），cardiac index小 於2.4L/min/m2 ②可藉肺動脈導管測得的血紅素氧氣飽和度（SvO2:mixed venous oxygen saturation），呈
 現心輸出量和全身氧氣消耗量的平衡 ③麻醉醫師須以生理變化做基礎，多方調整心室前後負荷及心室收縮力 
 ④為降低全身氧氣消耗量，心臟手術術後照顧需要術後鎮靜及降低體溫
A. ①②③
B. ①②④
C. ①③④
D. ②③④

正確答案：A. ①②③